¿Qué tipo de formato tiene este ítem? El alcohol es bueno tomado con moderación  Totalmente en desacuerdo.  En desacuerdo.  Me es indiferente.  De acuerdo.  Totalmente de acuerdo. :
1. Escala de clasificación.
2. Formato “cloze”.
3. Emparejamiento.
4. Elección múltiple.
5. Listado.

Respuesta correcta: 1. Escala de clasificación.